Clinical trial exclusion criterion:
low level of vitamin B12 and folate which are considered as clinically relevant

Annotated entities:
- Measurement: "level of vitamin B12"
- Value: "low"
- Measurement: "folate level of"